Clinical trial exclusion criterion:
emergency operation

Entity relations:
- Has_qualifier("operation", "emergency")